immunodepressed patients (bone marrow transplant patients, patients with severe neutropenia),

The above is a clinical trial exclusion criterion. Annotated with entity spans:
[Condition: immunodepressed] patients ([Procedure: bone marrow transplant] patients, patients with [Condition: severe neutropenia]),